下列有關 muscarinic cholinergic receptors 的敘述，何者正確？
A. 是一種 G-protein-coupled receptors
B. 高密度分布於骨骼肌終板（end plate）
C. 與 acetylcholine 結合後能容許鈉與鉀離子通過
D. 高密度分布於交感與副交感節後神經胞體（soma）與樹突（dendrites）上

正確答案：A. 是一種 G-protein-coupled receptors